Clinical trial inclusion criteria:
parturient in labour without cervical dilation and regular uterine contractions

Annotated entities:
- Procedure: "labour"
- Person: "parturient"
- Negation: "without"
- Procedure: "cervical dilation"
- Condition: "regular uterine contractions"